Clinical trial inclusion criterion:
Under lamivudine/adefovir treatment for more than 1 year due to previous lamivudine resistance (LAM-R), current HBV DNA is undetectable (< 20 IU/ml) during enrollment.

Annotated entities:
- Drug: "lamivudine"
- Drug: "adefovir"
- Temporal: "more than 1 year"
- Observation: "lamivudine resistance"
- Observation: "LAM-R"
- Measurement: "HBV DNA"
- Value: "undetectable"
- Value: "< 20 IU/ml"
- Temporal: "during enrollment"
- Reference_point: "enrollment"